Nursing female.

The above is a clinical trial exclusion criterion. Annotated with entity spans:
[Observation: Nursing] [Person: female].